¿Cuál es el modelo de muestreo cuyo principio es acceder directamente a las aglomeraciones naturales de unidades en la población? (obreros en fábricas, estudiantes en universidades…):
1. Muestreo estratificado.
2. Muestreo aleatorio simple.
3. Muestreo de conglomerados.
4. Muestreo sistemático.
5. Muestreo en el tiempo.

Respuesta correcta: 3. Muestreo de conglomerados.